Where does TORC1 sequester during heat stress?

Upon heat stress, TORC1 is recruited to stress granules.